a follow-up at least 12 months

The above is a clinical trial inclusion criterion. Annotated with entity spans:
a [Observation: follow-up] [Temporal: at least 12 months]